兩眼瞳孔同時移向右方須有健全之：
A. 右第六顱神經及左第三顱神經
B. 右第三顱神經及左第六顱神經
C. 右第四顱神經及左第三顱神經
D. 右第六顱神經及左第四顱神經

正確答案：A. 右第六顱神經及左第三顱神經